下列那一型心室中隔缺損（ventricular septal defect），於東方種族常見，且比較容易造成主動脈瓣膜逆流（aortic valve regurgitation）？
A. 主動脈下型（subaortic type）
B. 肺動脈下型（subpulmonic type）
C. 肌肉型（muscular type）
D. 塉下型（infracristal type）

正確答案：B. 肺動脈下型（subpulmonic type）